Clinical trial inclusion criterion:
Have ≥2 days/week of heavy drinking (>4 drinks/day)

Entity relations:
- Has_multiplier("heavy drinking", "≥2 days/week")
- Has_value("drinks/day", ">4")